Clinical trial inclusion criterion:
3. Predicted adherence to the medication.

Annotated entities:
- Non-representable: "Predicted adherence to the medication."